1. Patients with histologically confirmed diagnosis of colorectal cancer presenting with unresectable stage IV (UICC) disease (primary tumor may be present)

The above is a clinical trial inclusion criterion. Annotated with entity spans:
[Parsing_Error: 1.] Patients with [Procedure: histologically] [Value: confirmed] diagnosis of [Condition: colorectal cancer] presenting with [Qualifier: unresectable] [Qualifier: stage IV (UICC)] [Condition: disease] (primary tumor may be present)